Clinical trial exclusion criterion:
Evidence of current hepatitis C virus infection (HCV) (ie, HCV antibody [Ab] positive within 90 days prior to study entry unless also shown to be plasma HCV RNA negative within the same time period)

Entity relations:
- Has_value("plasma HCV RNA", "negative")
- Has_value("HCV antibody [Ab]", "positive")
- Has_temporal("HCV antibody [Ab]", "within 90 days prior to study entry")
- Has_temporal("plasma HCV RNA", "within the same time period")
- Has_temporal("hepatitis C virus infection (HCV)", "current")
- Has_mood("hepatitis C virus infection (HCV)", "Evidence")
- Subsumes("hepatitis C virus infection (HCV)", "HCV antibody [Ab]")
- OR("HCV antibody [Ab]", "plasma HCV RNA")